Clinical trial inclusion criterion:
indication to surgery (symptoms of menometrorrhagia,

Annotated entities:
- Mood: "indication to"
- Procedure: "surgery"
- Condition: "menometrorrhagia"